Clinical trial exclusion criterion:
Clinically significant valvular heart disease

Annotated entities:
- Condition: "valvular heart disease"